Clinical trial inclusion criterion:
Able to complete full ankle flexion-extension bilaterally

Entity relations:
- Has_mood("complete full ankle flexion-extension bilaterally", "Able to")